Clinical trial inclusion criterion:
Good oral tolerance

Entity relations:
- Has_qualifier("oral tolerance", "Good")